Patient should be negative for HIV and B and C hepatitis.

The above is a clinical trial inclusion criterion. Annotated with entity spans:
Patient should be [Value: negative] for [Measurement: HIV] and [Measurement: B] and [Measurement: C hepatitis].